Clinical trial inclusion criteria:
Intrauterine fetal death as confirmed by absence of cardiac motion on ultrasound by Attending physician at the time of admission to the hospital.
Estimated gestational age greater than 20 weeks
Hemodynamically stable and appropriate for induction of labor as per primary clinical health team in house
Women with one prior low transverse cesarean delivery

Annotated entities:
- Condition: "Intrauterine fetal death"
- Condition: "absence of cardiac motion"
- Procedure: "ultrasound"
- Temporal: "at the time of admission to the hospital"
- Reference_point: "admission to the hospital"
- Measurement: "Estimated gestational age"
- Value: "greater than 20 weeks"
- Condition: "Hemodynamically stable"
- Procedure: "induction of labor"
- Person: "Women"
- Multiplier: "one"
- Procedure: "low transverse cesarean delivery"